a disease that might affect hepatic or renal function, contraindications to opioid analgesics, fetal growth retardation, signs of fetal asphyxia by cardiotocography, meconium stained amniotic fluid or placental insufficiency. The subjects should not have received fentanyl during the previous 14 days.

The above is a clinical trial exclusion criterion. Annotated with entity spans:
a [Condition: disease] that might [Qualifier: affect hepatic] or renal function, [Condition: contraindications] to [Drug: opioid analgesics], [Condition: fetal growth retardation], [Mood: signs of] [Condition: fetal asphyxia] by [Procedure: cardiotocography], [Condition: meconium stained amniotic fluid] or [Condition: placental insufficiency]. The subjects should [Negation: not] have received [Drug: fentanyl] [Temporal: during the previous 14 days].